Evidence or history of clinically significant allergic reactions to varenicline

The above is a clinical trial exclusion criterion. Annotated with entity spans:
Evidence or history of clinically significant [Condition: allergic] reactions to [Drug: varenicline]